Clinical trial exclusion criterion:
Contraindication to oxycodone

Entity relations:
- AND("Contraindication", "oxycodone")